Clinical trial exclusion criteria:
Not available for follow-up
Pregnant or breast-feeding
Chronic pain syndrome defined as use of any analgesic medication on a daily or near-daily basis
Allergic to or intolerant of investigational medications
Contra-indications to non-steroidal anti-inflammatory drugs: 1) history of hypersensitivity to NSAIDs or aspirin 2) active or history of peptic ulcer disease, chronic dyspepsia, or active or history of gastrointestinal bleed 3) Severe heart failure (NYHA 2 or worse) 4) hypertension (JNC7 stage 2 or worse) 5) Chronic kidney disease 3 or worse 6) Current use of anti-coagulants 7) Hepatitis 8) Alcoholism
Contra-indications to muscle relaxants: 1) Concurrent use of centrally acting opioids; 2) Renal impairment; 3) Liver abnormality including cirrhosis or elevated enzymes 4) Use of any of the following medications: fluvoxamine, fluoroquinolones, amiodarone, mexiletine, propafenone, verapamil, cimetidine, famotidine, acyclovir, ticlopidine, oral contraceptive pills

Annotated entities:
- Non-query-able: "Not available for follow-up"
- Condition: "Pregnant"
- Condition: "breast-feeding"
- Condition: "Chronic pain syndrome"
- Drug: "analgesic medication"
- Qualifier: "any"
- Multiplier: "on a daily basis"
- Multiplier: "on a near-daily basis"
- Condition: "Allergic"
- Condition: "intolerant"
- Drug: "investigational medications"
- Condition: "Contra-indications"
- Drug: "non-steroidal anti-inflammatory drugs"
- Condition: "hypersensitivity"
- Drug: "NSAIDs"
- Drug: "aspirin"
- Temporal: "history"
- Temporal: "active"
- Temporal: "history"
- Condition: "peptic ulcer disease"
- Condition: "chronic dyspepsia"
- Temporal: "active"
- Temporal: "history"
- Condition: "gastrointestinal bleed"
- Qualifier: "Severe"
- Condition: "heart failure"
- Measurement: "NYHA"
- Value: "2 or worse"
- Condition: "hypertension"
- Measurement: "JNC7 stage"
- Value: "2 or worse"
- Condition: "Chronic kidney disease"
- Temporal: "Current"
- Drug: "anti-coagulants"
- Condition: "Hepatitis"
- Condition: "Alcoholism"
- Condition: "Contra-indications"
- Drug: "muscle relaxants"
- Temporal: "Concurrent"
- Drug: "centrally acting opioids"
- Condition: "Renal impairment"
- Condition: "Liver abnormality"
- Condition: "cirrhosis"
- Condition: "elevated enzymes"
- Drug: "fluvoxamine"
- Drug: "fluoroquinolones"
- Drug: "amiodarone"
- Drug: "mexiletine"
- Drug: "propafenone"
- Drug: "verapamil"
- Drug: "cimetidine"
- Drug: "famotidine"
- Drug: "acyclovir"
- Drug: "ticlopidine"
- Drug: "oral contraceptive pills"